Clinical trial exclusion criterion:
Women with Non-proteinuric hypertension

Annotated entities:
- Condition: "Non-proteinuric hypertension"
- Person: "Women"